Clinical trial exclusion criterion:
Allergy to levetiracetam.

Annotated entities:
- Condition: "Allergy"
- Drug: "levetiracetam"